Clinical trial exclusion criterion:
Who are pregnant or planning to become pregnant during the study or in the future

Annotated entities:
- Condition: "pregnant"
- Mood: "planning to become"
- Condition: "pregnant"
- Temporal: "during the study"
- Temporal: "in the future"